Patients underwent percutaneous coronary intervention with drug-eluting stent;

The above is a clinical trial inclusion criterion. Annotated with entity spans:
Patients underwent [Procedure: percutaneous coronary intervention] with [Device: drug-eluting stent];